下列何者是肺結核（Tuberculosis）之初段預防工作？
A. 施打卡介苗
B. 做好個案發現工作
C. 及早給予正確診斷和處理
D. 發病個案登記管理

正確答案：A. 施打卡介苗